Clinical trial inclusion criterion:
Hypertension - untreated (Systolic Blood Pressure (SBP) ≥ 140 mm Hg or Diastolic Blood Pressure (DBP) ≥ 90 mm Hg) or treated

Entity relations:
- Has_value("Systolic Blood Pressure (SBP)", "≥ 140 mm Hg")
- Has_value("Diastolic Blood Pressure (DBP)", "≥ 90 mm Hg")
- Subsumes("Hypertension", "Systolic Blood Pressure (SBP)")
- Has_qualifier("Hypertension", "untreated")
- OR("Systolic Blood Pressure (SBP)", "Diastolic Blood Pressure (DBP)")
- OR("untreated", "treated")